Clinical trial inclusion criterion:
Fasting plasma glucose < 7,0 mM, HbA1c < 48 mmol/mol 3 months after RYGB

Annotated entities:
- Measurement: "Fasting plasma glucose"
- Value: "< 7,0 mM"
- Measurement: "HbA1c"
- Value: "< 48 mmol/mol"
- Temporal: "3 months after RYGB"
- Reference_point: "RYGB"
- Procedure: "RYGB"